有一 6 週大的男嬰，最近幾天吃奶後有嘔吐現象，沒有腹脹，但上腹部可觸摸到橄欖狀硬塊，你認為他可能是什麼疾病？
A. 肥厚性幽門阻塞（hypertrophic pyloric stenosis）
B. 十二指腸閉鎖（duodenal atresia）
C. 胃食道逆流（gastroesophageal reflux）
D. 腸套疊（intussusception）

正確答案：A. 肥厚性幽門阻塞（hypertrophic pyloric stenosis）